Clinical trial exclusion criterion:
Active tumor treated at the time of inclusion associated with expected survival less than one year

Annotated entities:
- Qualifier: "Active"
- Temporal: "Active"
- Condition: "tumor"
- Procedure: "treated"
- Temporal: "at the time of inclusion"
- Measurement: "expected survival"
- Value: "less than one year"